En el ojo humano:
1. Los fotorreceptores contactan con el humor vítreo.
2. La acomodación se debe al aumento de la curvatura de la córnea.
3. El epitelio pigmentario participa en la regeneración de la rodopsina.
4. Los conos y los bastones se distribuyen homogéneamente en toda la retina.
5. El mayor poder de refracción está en el cristalino.

Respuesta correcta: 3. El epitelio pigmentario participa en la regeneración de la rodopsina.